current diagnosis of narcolepsy with cataplexy OR healthy control

The above is a clinical trial inclusion criterion. Annotated with entity spans:
current diagnosis of [Condition: narcolepsy] with [Condition: cataplexy] OR [Condition: healthy] control